Un paciente de 72 años acude a consulta con pérdida de memoria progresiva y dificultad para encontrar las palabras de un año de evolución. ¿Cuál es la exploración más útil para caracterizar el tipo de déficit cognitivo que presenta?
1. Evaluación neuropsicológica.
2. Resonancia magnética cerebral.
3. Tomografía de Emisión de Positrones.
4. Electroencefalograma.

Respuesta correcta: 1. Evaluación neuropsicológica.